¿Qué permite aparear una secuencia de ShineDalgarno?:
1. La subunidad 30S del ribosoma con la 50S.
2. Un codón de terminación con un factor de terminación.
3. El primer codón del mRNA con su tRNA.
4. La secuencia del mRNA anterior al codón de iniciación con el ribosoma.

Respuesta correcta: 4. La secuencia del mRNA anterior al codón de iniciación con el ribosoma.